A history or currently hematologic and other cancers;

The above is a clinical trial exclusion criterion. Annotated with entity spans:
[Non-representable: A history or currently hematologic and other cancers;]